下列何者是成年人最常見的惡性淋巴瘤？
A. 瀰漫大B細胞淋巴瘤（diffuse large B-cell lymphoma）
B. 未特指周邊T細胞淋巴瘤（peripheral T-cell lymphoma, unspecified）
C. 退行性大細胞淋巴瘤（anaplastic large cell lymphoma）
D. 被套細胞淋巴瘤（mantle cell lymphoma）

正確答案：A. 瀰漫大B細胞淋巴瘤（diffuse large B-cell lymphoma）